What is the basis of the BLISS technique?

Here we present Breaks Labeling In Situ and Sequencing (BLISS), a versatile and quantitative method for genome-wide profiling of DNA double-strand breaks.